一位 25 歲年輕女性，乳房檢查發現左乳外側有一 2.1 公分之腫瘤，粗針切片檢查為浸潤性管道癌（ infiltrating ductal carcinoma），腋下無觸摸到淋巴結，其他檢查遠處未轉移，其癌症臨床分期（clinical  stage）為下列何者？
A. T1N0M0
B. T2N0M0
C. T1N1M0
D. T2N1M0

正確答案：B. T2N0M0